Clinical trial inclusion criterion:
Karnofsky/Lansky score 50 or greater

Entity relations:
- Has_value("Karnofsky/Lansky", "score 50 or greater")